Clinical trial inclusion criterion:
Subjects with controlled diabetes prior to entry must have a mean systolic/diastolic office blood pressure =128/78 mmHg (sitting, after 5 minutes of rest)

Entity relations:
- Has_index("prior to entry", "entry")
- Has_value("mean diastolic blood pressure", "78 mmHg")
- Has_value("mean systolic blood pressure", "128 mmHg")
- Has_index("after 5 minutes of rest", "rest")
- Has_qualifier("mean diastolic blood pressure", "sitting")
- Has_temporal("mean diastolic blood pressure", "after 5 minutes of rest")
- Has_qualifier("diabetes", "controlled")
- Has_temporal("diabetes", "prior to entry")
- Has_qualifier("mean systolic blood pressure", "sitting")
- Has_temporal("mean systolic blood pressure", "after 5 minutes of rest")